Clinical trial exclusion criterion:
Severe pelvic organ prolapse or prolapse to any degree that may prevent retention of the vaginal ring after insertion

Entity relations:
- Has_qualifier("pelvic organ prolapse", "Severe")
- Has_qualifier("pelvic organ prolapse", "may prevent retention of the vaginal ring after insertion")
- OR("pelvic organ prolapse", "prolapse")